Frozen embryo transfer cycles: at least 2 embryos

The above is a clinical trial inclusion criterion. Annotated with entity spans:
[Procedure: Frozen embryo transfer cycles]: [Multiplier: at least 2] [Condition: embryos]